History of a seizure disorder other than a single childhood febrile seizure.

The above is a clinical trial exclusion criterion. Annotated with entity spans:
[Temporal: History] of a [Condition: seizure disorder] [Negation: other than] a [Multiplier: single] [Condition: childhood febrile seizure].